What types of DNA mutations are induced by 2-hydroxy-dATP (2-OH-dATP)?

2-hydroxy-dATP mainly elicits G:C --> A:T transitions, and, to a lesser extent, G:C --> T:A transversions The induction of G:C --> T:A transversions by 2-OH-dATP indicates the formation of G*2-OH-dATP pairs. 2-OH-dATP also induces tandem (CC --> TT) mutations. Altogether, 2-OH-dATP induces both transition and transvertion mutations, such as A:T --> G:C, A:T --> C:G and G:C --> T:A mutations.